Dutch speaking (Dutch as primary language).

The above is a clinical trial inclusion criterion. Annotated with entity spans:
[Non-query-able: Dutch speaking (Dutch as primary language).]